Clinical trial inclusion criterion:
LTBI diagnosis as per Canadian TB Standards using either the Tuberculin Skin Test (TST) or the Interferon Gamma Release Assay (IGRA)

Entity relations:
- Subsumes("Tuberculin Skin Test", "TST")
- Subsumes("Interferon Gamma Release Assay", "IGRA")
- AND("Tuberculin Skin Test", "LTBI")
- OR("Tuberculin Skin Test", "Interferon Gamma Release Assay")